A terminal illness

The above is a clinical trial exclusion criterion. Annotated with entity spans:
A [Condition: terminal illness]